Clinical trial inclusion criterion:
18 years of age and older,

Entity relations:
- Has_value("age", "18 years and older")